Which cancer types are associated with mutations in the TWIST1 gene?

Cancer is caused by uncontrolled cell division. Mutations in TWIST1 are associated with breast cancer, prostate cancer, lung cancer, and lung cancer.